Clinical trial exclusion criterion:
Any major urological procedure in the preceding 90 days.

Annotated entities:
- Procedure: "major urological procedure"
- Temporal: "preceding 90 days"